下列那一個器官最不可能出現在通過胃體的橫截面影像上？
A. 肝臟
B. 脾臟
C. 腎臟
D. 空腸

正確答案：D. 空腸